Pre-existing dementia

The above is a clinical trial exclusion criterion. Annotated with entity spans:
[Temporal: Pre-existing] [Condition: dementia]